Clinical trial exclusion criterion:
Risk of severe alcohol withdrawal (e.g. history of seizures or delirium tremens)

Annotated entities:
- Qualifier: "severe"
- Condition: "alcohol withdrawal"
- Mood: "Risk of"
- Condition: "seizures"
- Temporal: "history"
- Condition: "delirium tremens"